¿En el tratamiento de qué trastorno proponen Foa y Rothbaum (1998) la metáfora de la “digestión psicológica” para explicar al paciente el objetivo de su intervención?:
1. Trastorno Obsesivo Compulsivo.
2. Trastorno de Ansiedad Generalizada.
3. Trastorno de Estrés Postraumático.
4. Trastorno de Pánico.

Respuesta correcta: 3. Trastorno de Estrés Postraumático.